Clinical trial inclusion criteria:
Provision of fully informed consent prior to study specific procedures.
Patients must be >= 19 years of age
RET fusion positive or FGFR2 fusion/other FGFR mutation Refractory solid tumor and/or specific sensitivity to Sunitinib by Avatar scan that has progressed following standard therapy or that has not responded to standard therapy or for which there is no standard therapy.
ECOG Performance status0-2
Have measurable or evaluated disease based on RECIST 1.1 as determined by investigator.
Absolute neutrophil count >= 1.5 x 109/L, Hemoglobin >= 9g/dL, Platelets>=100 x 109/L Bilirubin <= 1.5 x upper limit of normal AST/ALT <= 2.5 X upper limit of normal(5.0 x upper limit of normal, for subject with liver metastases) Creatinine<= 1.5 X UNL
Patients of child-bearing potential should be using adequate contraceptive measures should not be breast feeding and must have a negative pregnancy test prior to start of dosing
Adequate heart function

Annotated entities:
- Informed_consent: "Provision of fully informed consent prior to study specific procedures"
- Person: "age"
- Value: ">= 19 years"
- Measurement: "RET fusion"
- Value: "positive"
- Qualifier: "FGFR2 fusion"
- Qualifier: "FGFR mutation"
- Qualifier: "Refractory"
- Condition: "solid tumor"
- Qualifier: "sensitivity"
- Drug: "Sunitinib"
- Non-query-able: "y Avatar scan that has progressed following standard therapy or that has not responded to standard therapy or for which there is no standard therapy"
- Measurement: "ECOG Performance status"
- Value: "0-2"
- Non-query-able: "Have measurable or evaluated disease based on RECIST 1.1 as determined by investigator"
- Measurement: "Absolute neutrophil count"
- Value: ">= 1.5 x 109/L"
- Measurement: "Hemoglobin"
- Value: ">= 9g/dL,"
- Measurement: "Platelets"
- Value: ">=100 x 109/L"
- Measurement: "Bilirubin"
- Value: "<= 1.5 x upper limit of normal"
- Measurement: "AST"
- Measurement: "ALT"
- Value: "<= 2.5 X upper limit of normal("
- Condition: "liver metastases"
- Value: "5.0 x upper limit of normal"
- Measurement: "Creatinine"
- Value: "<= 1.5 X UNL"
- Measurement: "AST"
- Measurement: "ALT"
- Observation: "child-bearing potential"
- Procedure: "adequate contraceptive measures"
- Negation: "not be"
- Condition: "breast feeding"
- Value: "negative"
- Measurement: "pregnancy test"
- Temporal: "prior to start of dosing"
- Reference_point: "start of dosing"
- Condition: "Adequate heart function"
- Measurement: "heart function"
- Value: "Adequate"